30 歲女性，自幼便常有感冒症狀，並被告知有心雜音，身體診察所見如下：身高 160 cm，體重 60 kg，心跳規律，左上胸緣有三度收縮期射出性雜音（systolic ejection murmur），S2有固定性分裂（fixed splitting of S2），P2加重，最有可能的診斷是：
A. 心室中隔缺損（ventricular septal defect）
B. 心房中隔缺損（atrial septal defect）
C. 限制性心肌病變（restrictive cardiomyopathy）
D. 肺動脈高壓症（pulmonary hypertension）

正確答案：B. 心房中隔缺損（atrial septal defect）